位在腫瘤中心的癌細胞，常處於缺氧的環境，這些細胞偏好利用下列那一種醣類代謝途徑獲取ATP？
A. ß-oxidation
B. glycolysis
C. tricarboxylic acid cycle
D. pentose phosphate pathway

正確答案：B. glycolysis